El sulfametoxazol se microencapsula          por coacervación compleja utilizando:
1. Gelatina y goma arábiga.
2. Albúmina y goma arábiga.
3. Gelatina y alginato sódico.
4. Pectina y gelatina.
5. Goma arábiga y pectina.

Respuesta correcta: 1. Gelatina y goma arábiga.